Clinical trial exclusion criterion:
18. A psychiatric condition (e.g., suicidal ideation) or chronic alcohol or drug abuse problem, determined from the patient's medical history, which, in the opinion of the investigator, may pose a threat to patient compliance

Entity relations:
- Subsumes("psychiatric condition", "suicidal ideation")
- Has_qualifier("psychiatric condition", "may pose a threat to patient compliance")
- OR("psychiatric condition", "alcohol abuse problem", "drug abuse problem")